Clinical trial inclusion criterion:
OA cohort: Diagnosis of osteoarthritis made by physician.

Annotated entities:
- Condition: "OA"
- Condition: "osteoarthritis"
- Observation: "made by physician"